Clinical trial exclusion criterion:
Plans to move from Kansas City during the treatment and follow-up phase

Annotated entities:
- Non-query-able: "Plans to move from Kansas City during the treatment and follow-up phase"